下列何者是治療麻醉氣體引起的惡性高溫（malignant hyperthermia）最主要的藥物？
A. propranolol
B. dantrolene
C. doxazosin
D. nifedipine

正確答案：B. dantrolene